Clinical trial inclusion criterion:
Men and women 35 to 70 years of age

Annotated entities:
- Person: "Men"
- Person: "women"
- Value: "35 to 70 years"
- Person: "age"